What is the treatment of acute pericarditis?

A multidisciplinary approach is frequently necessary to treat acute pericarditis; the most frequent treatments are: antiinflammatory steroid and non-steroid drugs, antibiotic therapy, pericardial drainage and, less frequently ,intrapericardial irrigation of fibrinolytics;  antituberculous chemotherapy in presence of Tuberculous Agent